Failure of medical treatment or rehabilitation.

The above is a clinical trial inclusion criterion. Annotated with entity spans:
[Qualifier: Failure] of [Procedure: medical treatment] or [Procedure: rehabilitation].